Clinical trial exclusion criterion:
Significant alcohol withdrawal (CIWA>8) at screening, after confirming a blood alcohol level of zero.

Entity relations:
- Has_value("CIWA", ">8")
- Subsumes("Significant", "CIWA")
- Has_qualifier("alcohol withdrawal", "Significant")
- Has_value("blood alcohol level", "zero")
- Has_temporal("alcohol withdrawal", "at screening")